Contraindications for medication abortion

The above is a clinical trial exclusion criterion. Annotated with entity spans:
[Condition: Contraindications] for [Procedure: medication abortion]